Clinical trial inclusion criterion:
TB screening: chest X-Ray unless performed in the last 6 months

Entity relations:
- Subsumes("TB screening", "chest X-Ray")